Clinical trial exclusion criterion:
Chronic opiate use

Entity relations:
- Has_multiplier("opiate", "Chronic")